Menopausal status

The above is a clinical trial inclusion criterion. Annotated with entity spans:
[Condition: Menopausal] status